下列何者不發出肋間動脈？
A. 頭臂動脈幹（brachiocephalic trunk）
B. 內胸動脈（internal thoracic artery）
C. 肌膈動脈（musculophrenic artery）
D. 胸主動脈（thoracic aorta）

正確答案：A. 頭臂動脈幹（brachiocephalic trunk）